Clinical trial inclusion criteria:
The diagnosis of chronic bronchitis
The diagnosis of community-acquired pneumoniae
FEV1 value = 30-80%
The diagnosis of mild-severe acute exacerbation of chronic bronchitis (AECB)
Oxygen saturation < 90%

Annotated entities:
- Condition: "chronic bronchitis"
- Condition: "community-acquired pneumoniae"
- Measurement: "FEV1 value"
- Value: "= 30-80%"
- Qualifier: "mild-severe"
- Qualifier: "acute"
- Condition: "exacerbation of chronic bronchitis"
- Condition: "AECB"
- Measurement: "Oxygen saturation"
- Value: "< 90%"